Clinical trial exclusion criterion:
Severe respiratory disease

Annotated entities:
- Condition: "respiratory disease"
- Qualifier: "Severe"